Clinical trial exclusion criterion:
Heavy tobacco smokers

Annotated entities:
- Condition: "Heavy tobacco smokers"